Clinical trial inclusion criterion:
Emergency Department patient

Annotated entities:
- Visit: "Emergency Department"